Clinical trial exclusion criterion:
taking medicine within one month.

Annotated entities:
- Drug: "medicine"
- Qualifier: "within one month"